Clinical trial exclusion criterion:
history of prior colonic or rectal surgery

Entity relations:
- Has_temporal("colonic surgery", "prior")
- Has_temporal("colonic surgery", "history of")
- OR("colonic surgery", "rectal surgery")